Current/recent upper respiratory infection (within four weeks prior to the surgery)

The above is a clinical trial exclusion criterion. Annotated with entity spans:
[Temporal: Current]/[Temporal: recent] [Condition: upper respiratory infection] ([Temporal: within four weeks prior to the surgery])